Clinical trial exclusion criterion:
Shielding of any part of the esophagus during radiotherapy (including posterior spinal cord shielding)

Entity relations:
- Has_multiplier("esophagus", "any part of")
- Has_qualifier("Shielding", "esophagus")
- Subsumes("Shielding", "posterior spinal cord shielding")